Clinical trial inclusion criterion:
Resting functional residual capacity (FRC) >120% predicted;

Annotated entities:
- Measurement: "Resting functional residual capacity (FRC)"
- Value: ">120% predicted"